HIV-1各分離株（isolates）之間常有變異性，尤其那個基因差異最大？
A. env
B. gag
C. pol
D. LTR

正確答案：A. env